Dyphyllobotrium latum compite con su hospedador definitivo por la vitamina:
1. A.
2. B 12.
3. C.
4. D.
5. E.

Respuesta correcta: 2. B 12.